最常見的子宮腫瘤為：
A. 肉瘤（sarcoma）
B. 腺肌症（adenomyosis）
C. 腺癌（adenocarcinoma）
D. 平滑肌瘤（leiomyoma）

正確答案：D. 平滑肌瘤（leiomyoma）